下列何者是合併藥物使用治療肺結核的最主要原因？
A. 預防產生抗藥性
B. 減少誘發副作用
C. 增加抑制 Mycobacteria 的作用
D. 增加對抗其他細菌感染的作用

正確答案：A. 預防產生抗藥性